Clinical trial exclusion criterion:
history of ARF,scarlet fever,impetigo,acute glomerulonephritis

Annotated entities:
- Condition: "ARF"
- Temporal: "history"
- Condition: "scarlet fever"
- Condition: "impetigo"
- Condition: "acute glomerulonephritis"